Posee un único núcleo en posición central:
1. Fibra muscular esquelética.
2. Fibra muscular cardíaca.
3. Osteoclasto.
4. Trombocito.
5. Eritrocito.

Respuesta correcta: 2. Fibra muscular cardíaca.